50 歲的王先生為 B 型肝炎帶原者。某日至某醫學中心接受肝臟超音波檢查，發現右肝有疑似小型肝癌之現象。王先生最需要檢測的血液檢查為何？
A. 膽固醇（cholesterol）
B. 運鐵蛋白（transferrin）
C. α1-抗胰蛋白酶（alpha 1-antitrypsin）
D. 甲型胎兒蛋白（alpha fetoprotein）

正確答案：D. 甲型胎兒蛋白（alpha fetoprotein）